Clinical trial inclusion criteria:
Adult acute myeloid leukemia
Age: ≥18 and ≤ 60
Clinical condition of the patient allows to carry out induction therapy: ECOG performance status: ≤ 2 and the Hematopoietic Cell Transplant-Co-morbidity Index (HCT-I): ≤3
Informed consent to participate in the study (ICF signed)
The second early induction start criteria is in addition to the listed above, the percentage of the blasts on the level >10% on 7th day.

Annotated entities:
- Condition: "Adult acute myeloid leukemia"
- Person: "Age"
- Value: "≥18 and ≤ 60"
- Measurement: "ECOG performance status"
- Value: "≤ 2"
- Measurement: "Hematopoietic Cell Transplant-Co-morbidity Index (HCT-I)"
- Value: "≤3"
- Post-eligibility: "Informed consent to participate in the study (ICF signed)"
- Measurement: "percentage of the blasts"
- Value: ">10%"
- Temporal: "on 7th day"